birthweight greater than 2.4 kg

The above is a clinical trial inclusion criterion. Annotated with entity spans:
[Measurement: birthweight] [Value: greater than 2.4 kg]